women and men between 18 - 80 years of age

The above is a clinical trial inclusion criterion. Annotated with entity spans:
[Person: women] and [Person: men] [Value: between 18 - 80 years] of [Person: age]